Clinical trial exclusion criterion:
Serum ferritin level < 20 ng/mL at screening.

Annotated entities:
- Measurement: "Serum ferritin"
- Value: "< 20 ng/mL"